La ecuación MDRD permite calcular el filtrado glomerular con una fórmula abreviada que incluye, además de la creatinina sérica, los siguientes parámetros EXCEPTO:
1. Edad.
2. Talla.
3. Sexo.
4. Raza.

Respuesta correcta: 2. Talla.